在中樞神經系統的發育中，下列何者是衍生自基板神經母細胞（neuroblasts of basal plates）：
A. 背角（dorsal horn）
B. 下丘（inferior colliculus）
C. 薄核（gracile nucleus）
D. 紅核（red nucleus）

正確答案：D. 紅核（red nucleus）